Clinical trial inclusion criteria:
All renal (only) male and female recipients aged = 60, years undergoing kidney transplantation from a living or deceased donor, including Expanded Criteria Donors (ECD).
Panel Reactive Antibody (PRA) < 30%.
Patients who consented to participate in the study by signing the informed consent form before the transplant surgery to the 1st post-operative day).

Annotated entities:
- Person: "male"
- Person: "female"
- Measurement: "aged"
- Value: "= 60"
- Condition: "recipients renal"
- Procedure: "kidney transplantation"
- Qualifier: "living donor"
- Qualifier: "deceased donor"
- Qualifier: "Expanded Criteria Donors (ECD)"
- Measurement: "Panel Reactive Antibody (PRA)"
- Value: "< 30%"
- Informed_consent: "Patients who consented to participate in the study by signing the informed consent form before the transplant surgery to the 1st post-operative day)"